Clinical trial exclusion criterion:
Have participated in an interventional, medical, surgical, or pharmaceutical study within 30 days of screening.

Entity relations:
- Has_temporal("interventional study", "within 30 days of screening")
- Has_index("within 30 days of screening", "screening")
- OR("interventional study", "medical study", "surgical study", "pharmaceutical study")